Clinical trial inclusion criterion:
physical status I - III

Entity relations:
- Has_value("physical status", "I - III")